Where is base J found in the genome of Leishmania tarentolae?

base j (β-d-glucosyl-hydroxymethyluracil) replaces 1% of t in the leishmania genome and is only found in telomeric repeats (99%) and in regions where transcription starts and stops.